下列關於子宮頸癌（cervical cancer）的敘述，何者錯誤？
A. 發生率較高的地域包括南美洲、加勒比海及東南亞
B. 有性行為前接受HPV疫苗注射可以減少HPV-16及HPV-18的感染，也可減少子宮頸的dysplasia
C. HPV的E6及E8分子是HPV相關子宮頸癌之致病因子
D. 侵犯骨盆腔或陰道下三分之一的子宮頸癌屬於FIGO分期的第三期

正確答案：C. HPV的E6及E8分子是HPV相關子宮頸癌之致病因子